有關腸胃道基質瘤（gastrointestinal stromal tumor，GIST）的敘述，下列何者正確？①在所有消化道中均可能出現，其中最常出現於胃部 ②屬於肌肉瘤（leiomyoma）的一種，與幽門螺旋桿菌無關 ③惡性 GIST 不會侵犯淋巴結及周邊組織 ④大多數 GIST 與 c-kit mutation 有關，因此 imatinib（Gleevec）是治療選擇之一
A. ①③
B. ②④
C. ①④
D. ②③

正確答案：C. ①④